lithium

The above is a clinical trial exclusion criterion. Annotated with entity spans:
[Drug: lithium]